下列何者不存在精索（spermatic cord）內？
A. 髂腹下神經（iliohypogastric nerve）
B. 輸精管（ductus deferens）
C. 提睪肌動脈（cremasteric artery）
D. 鞘突遺跡（vestige of vaginal process）

正確答案：A. 髂腹下神經（iliohypogastric nerve）